Clinical trial inclusion criterion:
Menopausal status

Annotated entities:
- Condition: "Menopausal"